Clinical trial exclusion criteria:
Intranasal steroid use within the last three months
Current systemic steroid use
Prior septal surgery
Individuals who are pregnant or actively breastfeeding

Annotated entities:
- Procedure: "Intranasal steroid use"
- Temporal: "within the last three months"
- Qualifier: "Intranasal"
- Drug: "steroid"
- Temporal: "Current"
- Procedure: "systemic steroid use"
- Qualifier: "systemic"
- Drug: "steroid"
- Temporal: "Prior"
- Procedure: "septal surgery"
- Condition: "pregnant"
- Temporal: "actively"
- Observation: "breastfeeding"